以預防醫學的角度觀之，大於 40 歲的正常女性，應多久接受一次乳房攝影檢查（mammography）？
A. 每 3~6 個月
B. 每 1~2 年
C. 每 3~5 年
D. 每 10 年

正確答案：B. 每 1~2 年